El producto final del catabolismo de la guanina en el ser humano es:
1. Xantina.
2. Ácido úrico.
3. Urea.
4. Β-alanina.

Respuesta correcta: 2. Ácido úrico.